Clinical trial inclusion criterion:
Pregnant or lactating women.

Annotated entities:
- Condition: "Pregnant"
- Condition: "lactating"
- Person: "women"